Which disease is associated with X-linked recessive TLR7 deficiency?

COVID-19